Clinical trial inclusion criterion:
Patients will be included if they are having an in-patient spinal fusion procedure, are 18 years or older, post and post-operative pain control plan includes opioid medications.

Annotated entities:
- Visit: "in-patient"
- Procedure: "spinal fusion procedure"
- Value: "18 years or older"
- Person: "years"
- Temporal: "post-operative"
- Procedure: "pain control plan"
- Drug: "opioid"